Chronic nasal congestion

The above is a clinical trial exclusion criterion. Annotated with entity spans:
[Temporal: Chronic] [Condition: nasal congestion]